Clinical trial exclusion criterion:
Alanine aminotransferase (ALT) or aspartate aminotransferase (AST) > 3 times upper limit of normal (ULN)

Entity relations:
- Has_value("aspartate aminotransferase (AST)", "> 3 times upper limit of normal (ULN)")
- Has_value("Alanine aminotransferase (ALT)", "> 3 times upper limit of normal (ULN)")
- OR("Alanine aminotransferase (ALT)", "aspartate aminotransferase (AST)")